Clinical trial exclusion criterion:
Inflammatory arthritis or diabetes,

Annotated entities:
- Condition: "Inflammatory arthritis"
- Condition: "diabetes"